Clinical trial exclusion criterion:
2. Screening tool: TMS adult safety screening, Medical History.

Annotated entities:
- Parsing_Error: "2."
- Procedure: "Screening"
- Procedure: "TMS adult safety screening"
- Temporal: "Medical History"